七個月的兒童有下列那一個臨床表徵的出現是需要轉診至早期療育中心做進一步評估？
A. 須扶著才能坐的穩
B. 不能拿湯匙餵食自己
C. 兩眼有內斜視
D. 俯臥時頭抬不起來

正確答案：D. 俯臥時頭抬不起來